Clinical trial exclusion criterion:
Pregnancy and Lactation

Annotated entities:
- Condition: "Pregnancy"
- Condition: "Lactation"